Indique cuál de los siguientes compuestos fosforilados presenta el mayor potencial de transferencia de fosforilos:
1. Creatina Fosfato.
2. ATP.
3. Glicerol 3-Fosfato.
4. Fosfoenolpiruvato.

Respuesta correcta: 4. Fosfoenolpiruvato.